Clinical trial exclusion criterion:
18. Human immunodeficiency virus positivity

Entity relations:
- Has_value("Human immunodeficiency virus", "positivity")
- multi("Human immunodeficiency virus", "Human immunodeficiency virus")